70 歲男性經內視鏡檢查及組織切片發現有胃腺癌，請問下列何者與病人胃癌之發生較無相關？
A. 萎縮性胃炎
B. 部分胃切除手術
C. 高鹽高醃漬食物
D. 吃檳榔

正確答案：D. 吃檳榔